Una mujer embarazada acude a la urgencia del hospital por una cefalea intensa que no remite con los analgésicos (paracetamol). Primigesta, presenta una gestación única de 17+1 semanas, en la exploración se obtienen cifras de Tensión Arterial de 160/100 mmHg no presentando proteínas en la orina. Podemos encontrarnos ante un caso de:
1. Hipertensión gestacional.
2. Hipertensión crónica no diagnosticada.
3. Pre-eclampsia.
4. Pre-eclampsia sobreañadida a una hipertensión crónica.

Respuesta correcta: 2. Hipertensión crónica no diagnosticada.